Clinical trial inclusion criterion:
HYPERTENSIVE: history of BP >140/90, 1 or more antihypertensive medications, LV ejection fraction (LVEF) at least 50%, current BP < 160/90

Entity relations:
- Has_value("BP", ">140/90")
- Has_multiplier("antihypertensive medications", "1 or more")
- Has_value("LV ejection fraction (LVEF)", "at least 50%")
- Has_value("BP", "< 160/90")
- Has_temporal("BP", "current")
- AND("HYPERTENSIVE", "BP")
- Has_temporal("HYPERTENSIVE", "history")
- AND("HYPERTENSIVE", "antihypertensive medications")
- AND("HYPERTENSIVE", "LV ejection fraction (LVEF)")
- AND("HYPERTENSIVE", "BP")